Clinical trial exclusion criteria:
Current DVT
Recurrent varicose veins
Arterial disease (ABPI<0.8)
Vein diameter < 3mm
Preference for one of the treatment options
Patient who are unwilling to participate
Inability or unwillingness to complete questionnaires
Inability to attend follow-up appointments
Patient currently included in a study of varicose vein treatment

Annotated entities:
- Procedure: "DVT"
- Temporal: "Current"
- Condition: "varicose veins"
- Multiplier: "Recurrent"
- Condition: "Arterial disease"
- Measurement: "ABPI"
- Value: "<0.8"
- Measurement: "Vein diameter"
- Value: "< 3mm"
- Non-representable: "Preference for one of the treatment options"
- Observation: "unwilling to participate"
- Observation: "unwillingness to complete questionnaires"
- Observation: "Inability to complete questionnaires"
- Observation: "Inability to attend follow-up appointments"
- Competing_trial: "Patient currently included in a study of varicose vein treatment"